有關小孩包皮的敘述，下列何者正確？
A. 為了預防癌症，減少尿路感染，最好每位小孩都施行包皮環切術
B. 在3歲時，大約90%未接受包皮手術的小孩都可以有自然包皮退下的機會
C. 包皮手術簡單安全，因此不會造成任何併發症
D. 使用類固醇局部	抹，無法有效使包皮環變鬆而自然退下

正確答案：B. 在3歲時，大約90%未接受包皮手術的小孩都可以有自然包皮退下的機會